Clinical trial exclusion criterion:
receiving medication that could interfere with the study protocol objectives (hormonal contraceptives, androgens, prednisone, thyroid hormones, insulin)

Annotated entities:
- Drug: "medication"
- Qualifier: "could interfere with the study protocol objectives"
- Drug: "hormonal contraceptives"
- Drug: "androgens"
- Drug: "prednisone"
- Drug: "thyroid hormones"
- Drug: "insulin"
- Temporal: "receiving"